處理腦性麻痺患者的肌肉痙攣，那一種方法的效果最持久？
A. 治療性運動
B. 口服抗痙攣藥物
C. 酚（phenol）神經阻斷術
D. 選擇性背神經根切除術（selective posterior rhizotomy）

正確答案：D. 選擇性背神經根切除術（selective posterior rhizotomy）